Patients who have received an investigational drug within 30 days prior to the current agitation episode must be excluded.

The above is a clinical trial exclusion criterion. Annotated with entity spans:
[Competing_trial: Patients who have received an investigational drug within 30 days prior to the current agitation episode must be excluded].